Phase 1 Specific Patient at least 18yrs of age with histologically confirmed CLL/SLL or B-cell Non-Hodgkin lymphoma (DLBCL, FL, MCL, MZL, lymphoplasmacytic lymphoma).

The above is a clinical trial inclusion criterion. Annotated with entity spans:
Phase 1 Specific Patient [Value: at least 18yrs] of [Person: age] with [Procedure: histologically] [Value: confirmed] [Condition: CLL]/[Condition: SLL] or [Condition: B-cell Non-Hodgkin lymphoma] ([Condition: DLBCL], [Condition: FL], [Condition: MCL], [Condition: MZL], [Condition: lymphoplasmacytic lymphoma]).